Los test adaptativos se caracterizan por:
1. La relación unidireccional entre el evaluado y la prueba.
2. El proceso interactivo de selección de ítems dependiente de la respuesta del evaluado.
3. La aplicación homogénea e idéntica de los ítems a todos los evaluados.
4. La idéntica longitud en el número de ítems a aplicar.
5. La selección de ítems por criterios independientes a la respuesta del evaluado.

Respuesta correcta: 2. El proceso interactivo de selección de ítems dependiente de la respuesta del evaluado.